Thyroid problems the PI deems them to be ineligible for

The above is a clinical trial exclusion criterion. Annotated with entity spans:
[Condition: Thyroid problems] the PI deems them to be ineligible for